Clinical trial inclusion criterion:
=3 episodes of VT treated with antitachycardia pacing (ATP), at least one of which was symptomatic

Entity relations:
- Subsumes("antitachycardia pacing", "ATP")
- Has_multiplier("VT", "3 episodes")
- AND("VT", "antitachycardia pacing")
- Has_multiplier("symptomatic", "at least one")
- Has_qualifier("VT", "symptomatic")